Paciente de 70 años con el único antecedente de ser ex-alcohólico desde hace 3 años y diagnosticado de gastritis atrófica. Consulta por cuadro de 4 meses de evolución que se inició con parestesias distales y simétricas en miembros inferiores y progresivamente fue añadiéndose dificultad para la marcha, siendo esta imposible sin ayuda, y episodios confusionales de presentación paroxística. A la exploración neurológica los pares craneales son normales, presenta una ligera bradipsiquia, fallos en sensibilidad profunda en cuatro miembros, actitud     pseudodistónica      en    miembros superiores, dismetría dedo-nariz y talón rodilla bilateral    con    ojos     cerrados,    reflejos osteotendinosos exaltados, Babinski bilateral y paresia distal en miembros superiores. Señale la respuesta correcta:
1. Realizar un hemograma y determinación de B12 ante la sospecha de una mielosis funicular.
2. Realizar una RM buscando una atrofia de vermis y de folias cerebelosas ante la alta sospecha de degeneración cerebelosa alcohólica.
3. Se debería administrar de inicio 100 mg de tiamina intravenosa por la sospecha de una encefalopatía de Wernicke-Korsakoff.
4. Lo primero a realizar sería una determinación de natremia para descartar una mielinolisis central pontina.
5. Realizar un estudio electromiográfico ante la alta sospecha de una esclerosis lateral primaria.

Respuesta correcta: 1. Realizar un hemograma y determinación de B12 ante la sospecha de una mielosis funicular.